接受過心臟移植的病患要運動時，判斷運動訓練強度最適當的指標為何？
A. 自覺用力係數（rating of perceived exertion）
B. 心跳速率（heart rate）
C. 血壓（blood pressure）
D. 體表氧血紅素飽和度（SpO2）

正確答案：A. 自覺用力係數（rating of perceived exertion）